Clinical trial exclusion criterion:
Projected life expectancy less than 30 days

Entity relations:
- Has_value("Projected life expectancy", "less than 30 days")